Clinical trial exclusion criterion:
Patients who do not agree to the proposed treatment or will receive (part of) the treatment in a non-participating centre

Annotated entities:
- Negation: "not"
- Observation: "agree to the proposed treatment"
- Visit: "non-participating centre"
- Procedure: "treatment"